Clinical trial inclusion criterion:
Written informed consent obtained from the subject or subject's legal representative

Entity relations:
- Has_qualifier("Written informed consent", "from the subject")
- OR("from the subject", "from the subject's legal representative")